El “reflejo patelar” consiste en:
1. Extensión del pie en respuesta a la percusión del tendón de Aquiles.
2. Extensión del dedo gordo del pie en respuesta a la estimulación del borde interno de la planta del pie.
3. La extensión de la pierna en respuesta a la percusión sobre el tendón rotuliano.
4. El parpadeo en respuesta al toque de la córnea.
5. La extensión en abanico de los dedos del pie en respuesta a la estimulación de la planta del pie.

Respuesta correcta: 3. La extensión de la pierna en respuesta a la percusión sobre el tendón rotuliano.